Is APOBEC3B protein predominantly cytoplasmic or nuclear?

Contrary to other APOBEC family members, APOBEC3B was found to predominantly concentrate to the cell nucleus.